Clinical trial exclusion criterion:
Uncontrolled hypertension defined as systolic >180 mmHg or > 160 mmHg on 2 consecutive measurements or diastolic > 100 mmHg on optimal medical regimen

Annotated entities:
- Condition: "Uncontrolled hypertension"
- Measurement: "systolic"
- Value: ">180 mmHg"
- Value: "> 160 mmHg"
- Multiplier: "on 2 consecutive measurements"
- Measurement: "diastolic"
- Value: "> 100 mmHg"
- Procedure: "optimal medical regimen"
- Qualifier: "on optimal medical regimen"